Clinical trial exclusion criterion:
Age younger than 18 yrs. or older than 75 yrs.

Entity relations:
- Has_value("Age", "younger than 18 yrs. or older than 75 yrs.")